Clinical trial inclusion criterion:
= 2 mm ST-elevation across 2 contiguous precordial leads (V1-V6) or leads I and aVL for a minimum combined total of = 4 mm ST-elevation or

Annotated entities:
- Non-query-able: "= 2 mm ST-elevation across 2 contiguous precordial leads (V1-V6) or leads I and aVL for a minimum combined total of = 4 mm ST-elevation"